Clinical trial exclusion criterion:
Abnormal Electro-cardiogram (ECG)

Entity relations:
- Subsumes("Electro-cardiogram", "ECG")
- Has_value("Electro-cardiogram", "Abnormal")